Clinical trial exclusion criterion:
Platelets = 50,000/mm3

Entity relations:
- Has_value("Platelets", "= 50,000/mm3")